Clinical trial exclusion criterion:
Planned elective surgery within 30 days of the Final Study Visit.

Annotated entities:
- Procedure: "elective surgery"
- Mood: "Planned"
- Non-query-able: "Planned"
- Temporal: "within 30 days of the Final Study Visit"
- Reference_point: "Final Study Visit"